History or presence of clinically important hepatic or renal disease or other medical disease.

The above is a clinical trial exclusion criterion. Annotated with entity spans:
[Temporal: History] or presence of [Condition: clinically important] hepatic or renal disease or other medical disease.